Able to perform a visible contraction with dorsiflexor and hip flexor muscles (allowing testing of largely impaired patients)

The above is a clinical trial inclusion criterion. Annotated with entity spans:
[Non-representable: Able to perform a visible contraction with dorsiflexor and hip flexor muscles (allowing testing of largely impaired patients)]